在血液抹片染色，下列何者是最大的血球？
A. 紅血球
B. 淋巴球
C. 單核球
D. 嗜中性球

正確答案：C. 單核球